Indique cuál de los siguientes trastornos cursará con ictericia:
1. Síndrome de Gilbert.
2. Síndrome de Zellwerger.
3. Tiroiditis de Hasimoto.
4. Enfermedad de Cushing.
5. Alcaptonuria.

Respuesta correcta: 1. Síndrome de Gilbert.